有關各種抗生素作用機轉的敘述，下列何者正確？
A. cephalosporins是抑制細菌細胞壁的合成與發展
B. vancomycin是抑制細菌蛋白質的合成
C. rifampin是抑制細菌去氧核醣核酸（DNA）的合成
D. quinolones是抑制細菌核糖核酸（RNA）的合成

正確答案：A. cephalosporins是抑制細菌細胞壁的合成與發展